En la replicación del ADN de eucariotas las funciones que corresponden a la ADN polimerasa gamma (γ) son:
1. Síntesis translacional del ADN nuclear.
2. Replicación y reparación del ADN mitocondrial.
3. Iniciación de la síntesis del ADN nuclear.
4. Reparación del ADN nuclear.
5. Síntesis de la cadena líder y retrasada del ADN nuclear.

Respuesta correcta: 2. Replicación y reparación del ADN mitocondrial.